Clinical trial inclusion criteria:
Primary total hip arthroplasty (THA)

Annotated entities:
- Qualifier: "Primary"
- Condition: "total hip arthroplasty"
- Condition: "THA"